Patients who have received a drug-eluting stent (DES) procedure within the past 6 months

The above is a clinical trial exclusion criterion. Annotated with entity spans:
Patients who have received a [Procedure: drug-eluting stent] ([Procedure: DES]) procedure within the [Temporal: past 6 months]